下列何者不屬於Berlin與Fowkes所發展出來的LEARN模式？
A. 傾聽（listen）
B. 解釋（explain）
C. 支持（advocacy）
D. 建議（recommend）

正確答案：C. 支持（advocacy）